Clinical trial exclusion criterion:
History of Stomach or esophagus surgery

Annotated entities:
- Procedure: "esophagus surgery"
- Procedure: "Stomach surgery"